Clinical trial exclusion criterion:
Patients who previously participated in any Aliskiren study.

Annotated entities:
- Drug: "Aliskiren"
- Temporal: "previously"
- Competing_trial: "Aliskiren study"